What is filipin staining used for?

Intracellular and total cholesterol (TC) were measured using filipin staining.